Clinical trial exclusion criterion:
Patients with moderate to severe hepatic encephalopathy.

Annotated entities:
- Qualifier: "severe"
- Qualifier: "moderate"
- Condition: "hepatic encephalopathy"